Patients who agree to use an effective method of contraception throughout the clinical trial.

The above is a clinical trial inclusion criterion. Annotated with entity spans:
[Pregnancy_considerations: Patients who agree to use an effective method of contraception throughout the clinical trial.]